Clinical trial exclusion criteria:
School districts that are too difficult to reach (more than a 3-hour walk from the farthest place reachable by a four-wheel drive vehicle)
School districts in the 2 urban regions of the study area
Refusal of village chief
All residents residing near to the well sites that are randomly selected for this study.
Refusal of participant [or parent/guardian]

Annotated entities:
- Visit: "School districts that are too difficult to reach"
- Measurement: "walk from the farthest place reachable by a four-wheel drive vehicle"
- Value: "more than a 3-hour"
- Visit: "School districts in the 2 urban regions of the study area"
- Non-query-able: "Refusal of village chief"
- Observation: "residing"
- Visit: "near to the well sites"
- Informed_consent: "Refusal of participant [or parent/guardian]"